¿Cuál de estos compuestos dona directamente el 2º grupo amino al ciclo de la urea?
1. Aspártico.
2. Glutámico.
3. Glutamina.
4. Glicina.
5. Ornitina.

Respuesta correcta: 1. Aspártico.